intraocular pressure higher than 25 mmHg, or glaucoma

The above is a clinical trial exclusion criterion. Annotated with entity spans:
[Measurement: intraocular pressure] [Value: higher than 25 mmHg], or [Condition: glaucoma]